Contraindications according to summary of product characteristics of investigational test and reference product

The above is a clinical trial exclusion criterion. Annotated with entity spans:
[Non-representable: Contraindications according to summary of product characteristics of investigational test and reference product]